Clinical trial exclusion criterion:
Patients allergic to lidocaine or adhesive

Entity relations:
- AND("allergic", "lidocaine")
- OR("lidocaine", "adhesive")